Clinical trial exclusion criterion:
2. Patients in the acute phase of severe hepatitis

Entity relations:
- Has_qualifier("severe hepatitis", "acute phase")